Pregnant or lactating women.

The above is a clinical trial exclusion criterion. Annotated with entity spans:
[Condition: Pregnant] or [Condition: lactating] [Person: women].